下列何種兒童疾病最不符合骨髓移植之適應症？
A. 急性骨髓性白血病（acute myeloid leukemia）第二次緩解（second complete remission）
B. 先天重度免疫不全（severe combined immune deficiency）
C. 黏多醣症（mucopolysaccharidoses）之 Hunter 症候群
D. 重度再生不良性貧血（severe aplastic anemia）

正確答案：C. 黏多醣症（mucopolysaccharidoses）之 Hunter 症候群